先天性巨大結腸症（Hirschsprung disease）最常發生在何處？
A. 上行結腸
B. 橫行結腸
C. 下行結腸
D. 乙狀結腸

正確答案：D. 乙狀結腸